下列何者不直接匯入下腔靜脈（inferior vena cava）？
A. 左腎靜脈（left renal vein）
B. 左肝靜脈（left hepatic vein）
C. 左腎上腺靜脈（left suprarenal vein）
D. 左第三、四腰靜脈（left L3, 4 lumbar veins）

正確答案：C. 左腎上腺靜脈（left suprarenal vein）